What are 5 key questions in human performance modeling?

the five key questions of human performance modeling: 1) why we build models of human performance; 2) what the expectations of a good human performance model are; 3) what the procedures and requirements in building and verifying a human performance model are; 4) how we integrate a human performance model with system design; and 5) what the possible future directions of human performance modeling research are.